Antibiotic treatment or routine use of oral antiseptics in the previous 3 months.

The above is a clinical trial exclusion criterion. Annotated with entity spans:
[Drug: Antibiotic] treatment or [Multiplier: routine use] of [Drug: oral antiseptics] [Temporal: in the previous 3 months].